有關von Willebrand factor之敘述，下列何者錯誤？
A. 主要由血管平滑肌細胞製造
B. 血管壁受損時，可和血小板結合
C. 可直接活化血小板
D. 可調控凝血第八因子（factor VIII）

正確答案：A. 主要由血管平滑肌細胞製造